What is NTI, Nerve Tissue Contrast Index

The NTI is a ratio of average brightness levels of surrounding tissue and the median nerve, both calculated on the basis of a US image.